Clinical trial inclusion criterion:
18 years of age

Annotated entities:
- Value: "18 years"
- Person: "age"